Agrees not to participate in another clinical study/trial during the study period or to participate in an investigational drug study for at least one month after last study session

The above is a clinical trial inclusion criterion. Annotated with entity spans:
[Competing_trial: Agrees not to participate in another clinical study/trial during the study period or to participate in an investigational drug study for at least one month after last study session]